下列何種藥物除了常用於治療痛風外，對新生兒動脈導管閉鎖不全也有促進其關閉的作用？
A. indomethacin
B. etodolac
C. ketoprofen
D. naproxen

正確答案：A. indomethacin